Clinical trial inclusion criterion:
Capacity to give consent for study participation, after being adequately informed of the aims, benefits, risks, time and motion of the study.

Annotated entities:
- Non-query-able: "Capacity to give consent for study participation, after being adequately informed of the aims, benefits, risks, time and motion of the study."